Clinical trial exclusion criterion:
A known contraindication or hypersensitivity to all anticoagulation regimens, or inability to be anticoagulated for the study procedure.

Entity relations:
- Has_index("for the study procedure", "study procedure")
- AND("inability", "anticoagulated")
- AND("contraindication", "anticoagulation regimens")
- Has_temporal("inability", "for the study procedure")
- OR("contraindication", "hypersensitivity")
- OR("contraindication", "inability")